What is the incubation period for COVID-19?

The incubation period for COVID-19 is thought to be within 14 days following exposure, with most cases occurring approximately five to seven days after exposure. The incubation period also varies by viral variant. For example, the incubation period for the Delta variant (B.1.617.2) appears to be slightly shorter, with symptoms first appearing around four days after exposure.